Clinical trial exclusion criterion:
Methotrexate used within the previous 6 months

Annotated entities:
- Drug: "Methotrexate"
- Temporal: "within the previous 6 months"